Clinical trial inclusion criterion:
Histological diagnosis confirmed by two endoscopies with biopsies and two pathological readings; biopsies should be carried out according to the protocol of the SFED (four-quadrant biopsies every cm) with at least once acetic acid for staining. Operators describe Barrett's esophagus using he SFED planimetric model. The final exam will be no more than two months before the date of treatment and should have been achieved in investigator establishment,

Entity relations:
- multi("Histological", "Histological")
- Has_multiplier("endoscopies", "two")
- AND("Histological", "endoscopies")
- AND("endoscopies", "biopsies")
- Has_multiplier("pathological readings", "two")
- AND("Histological", "pathological readings")
- Has_qualifier("diagnosis", "Histological")